Clinical trial exclusion criterion:
History of renal insufficiency or requiring dialysis.

Annotated entities:
- Condition: "renal insufficiency"
- Temporal: "History"
- Procedure: "dialysis"
- Mood: "requiring"